下列有關乳房 MRI 檢查之敘述，何者錯誤？
A. 對於ductal carcinoma in situ（DCIS）之敏感度 ( sensitivity ) 可達 90%
B. 特異性 ( specificity) 屬中等 ( moderate ) 而已
C. 對於occult breast cancer之病人為相當有用的檢查
D. 對於高風險 ( high risk ) 病人可作為篩檢 ( screening ) 檢查

正確答案：A. 對於ductal carcinoma in situ（DCIS）之敏感度 ( sensitivity ) 可達 90%